Clinical trial exclusion criterion:
History of thromboembolic event (e.g., PE or DVT)

Entity relations:
- Subsumes("thromboembolic event", "PE")
- OR("PE", "DVT")